Clinical trial inclusion criterion:
Normotensive controls

Annotated entities:
- Procedure: "controls"
- Qualifier: "Normotensive"